Person who is not able to walk on level ground in a step over step manner.

The above is a clinical trial exclusion criterion. Annotated with entity spans:
[Non-query-able: Person who is not able to walk on level ground in a step over step manner].